Clinical trial inclusion criterion:
Clinical diagnosis of chronic plaque-type psoriasis of the body

Entity relations:
- Has_qualifier("psoriasis of the body", "plaque-type")
- Has_qualifier("psoriasis of the body", "chronic")